Clinical trial exclusion criteria:
age less than 18 years
allergy to study drugs
substance misuse other contraindication to used study drugs no informed consent

Annotated entities:
- Person: "age"
- Value: "less than 18 years"
- Condition: "allergy"
- Drug: "study drugs"
- Condition: "substance misuse"
- Condition: "contraindication"
- Drug: "study drugs"